HER-2 belongs to what family of proteins?

HER-2 is also known as human epidermal growth factor receptor 2 and is a member of the Epidermal growth factor receptor (EGFR) family, members of which are: EGFR, HER2, HER3, and HER4.